Clinical trial exclusion criterion:
Age less than 15 or greater than 25 and not participating in the day care center

Annotated entities:
- Person: "Age"
- Value: "less than 15"
- Value: "greater than 25"
- Observation: "participating in the day care center"
- Negation: "not"